3. Residence in AFRH-Washington D.C. or the Veterans Home of California-Yountville

The above is a clinical trial inclusion criterion. Annotated with entity spans:
3. [Observation: Residence] in [Visit: AFRH-Washington D.C.] or the [Visit: Veterans Home of California-Yountville]